What is the aim of the TRAP method?

The translating ribosome affinity purification (TRAP) method is used to obtain obtain translatome data.